How many groups of viruses exist  in the Baltimore Classification?

There are seven "Baltimore classes" (BCs) that define the major features of virus reproduction.